Clinical trial exclusion criterion:
Patients who in the judgment of the Investigator may be unreliable or uncooperative with the evaluation procedure outlined in this protocol;

Annotated entities:
- Non-query-able: "Patients who in the judgment of the Investigator may be unreliable or uncooperative with the evaluation procedure outlined in this protocol"